Chronic musculoskeletal lesion

The above is a clinical trial exclusion criterion. Annotated with entity spans:
[Condition: Chronic musculoskeletal lesion]